Cuando el punto de corte de un instrumento diagnóstico es muy alto, se incrementa el riesgo de:
1. Falsos positivos.
2. Falsos negativos.
3. Verdaderos positivos.
4. Sensibilidad de la prueba.
5. Inconsistencias de validez.

Respuesta correcta: 2. Falsos negativos.